有關石綿肺症（asbestosis）的敘述，下列何者錯誤？
A. 主要是暴露於石綿生產過程所造成，常見用於防火或電流絕緣的材料中
B. 肺部容易出現瀰漫性纖維化病灶
C. 可能合併出現肺癌或間皮細胞瘤（mesothelioma）
D. 肺功能出現阻塞性功能障礙及氣體瀰散量（diffusing capacity）下降，為病人呼吸急促的主因

正確答案：D. 肺功能出現阻塞性功能障礙及氣體瀰散量（diffusing capacity）下降，為病人呼吸急促的主因